Clinical trial inclusion criterion:
Understand and sign consent form

Annotated entities:
- Post-eligibility: "Understand and sign consent form"